Clinical trial exclusion criterion:
Patients who are on cyclosporine, bosentan, or potassium sparing diuretic.

Entity relations:
- OR("cyclosporine", "potassium sparing diuretic", "bosentan")